下列何種疾病不適合使用arginine vasopressin（AVP）拮抗劑（vaptans）？
A. 抗利尿激素不適當分泌症候群（SIADH）
B. 高體液低鈉血症（hypervolemic hyponatremia）
C. 小細胞肺癌合併之低鈉血症
D. 尿崩症（diabetes insipidus）

正確答案：D. 尿崩症（diabetes insipidus）